Clinical trial exclusion criterion:
Patients with previous permanent upper face fillers injection

Annotated entities:
- Procedure: "permanent fillers injection"
- Qualifier: "upper face"